physical status I - III

The above is a clinical trial inclusion criterion. Annotated with entity spans:
[Measurement: physical status] [Value: I - III]